Clinical trial inclusion criterion:
Patient should be clearly conscious, fully understand and able to answer questionnaire

Annotated entities:
- Post-eligibility: "Patient should be clearly conscious, fully understand and able to answer questionnaire"